FEV1 < 40% of predicted value, FEV1/FVC < 70%

The above is a clinical trial inclusion criterion. Annotated with entity spans:
[Measurement: FEV1] [Value: < 40% of predicted value], [Measurement: FEV1/FVC] [Value: < 70%]